Clinical trial exclusion criterion:
Subjects were not to use any over-the-counter medication within 7 days prior to or during the study.

Annotated entities:
- Temporal: "within 7 days prior to the study"
- Temporal: "during the study"
- Drug: "over-the-counter medication"
- Negation: "not"
- Reference_point: "the study"